currently on hemodialysis at a CDC dialysis unit

The above is a clinical trial inclusion criterion. Annotated with entity spans:
[Temporal: currently] on [Procedure: hemodialysis] at a [Visit: CDC dialysis unit]